Clinical trial inclusion criterion:
Locally advanced disease as determined by endoscopic ultrasound (EUS) stage > primary tumor (T) 3 and/or any T, lymph nodes (N)+ disease without metastatic disease (Mx)

Annotated entities:
- Condition: "disease"
- Qualifier: "Locally advanced"
- Procedure: "endoscopic ultrasound"
- Value: "> primary tumor (T) 3 and/or any T, lymph nodes (N)+ disease without metastatic disease (Mx)"
- Procedure: "EUS"